What is the meaning of the acronym "TAILS" used in protein N-terminomics?

TAILS stands for "Terminal Amine Isotopic Labeling of Substrates"